designated ASA physical status 4 or above

The above is a clinical trial exclusion criterion. Annotated with entity spans:
designated [Measurement: ASA physical status] [Value: 4 or above]